Renal dysfunction, including endogenous creatinine clearance male<120ml/min, female<105ml/min, serum creatinine=2mg/dl (186umol/L), Renal function progressive decline, GFR<30ml•min-1•1.73m-2;

The above is a clinical trial exclusion criterion. Annotated with entity spans:
[Condition: Renal dysfunction], including [Measurement: endogenous creatinine clearance] [Person: male][Value: <120ml/min], [Person: female][Value: <105ml/min], [Measurement: serum creatinine][Value: =2mg/dl] ([Value: 186umol/L]), [Measurement: Renal function] [Value: progressive decline], [Measurement: GFR][Value: <30ml•min-1•1.73m-2];